What is Targeted Chromatin Capture (T2C)?

Significant efforts have recently been put into the investigation of the spatial organization and the chromatin-interaction networks of genomes. T2C provides an unbiased view of the spatial organization of selected loci at superior resolution (single restriction fragment resolution, from 2 to 6 kbp) at much lower costs than Hi-C due to the lower sequencing effort.